Clinical trial inclusion criterion:
Children aged 0-59 months living with families registered in the rural Bandim Health Project Health and Demographic Surveillance Site are included, provided a parent/guardian consent.

Entity relations:
- Has_value("aged", "0-59 months")